Clinical trial exclusion criteria:
osteoarticular, neuromuscular or cognitive limitation that prevents ambulation
previous diagnosis of active neoplastic disease
institutionalized patients; alcohol consumption >60 g/day
patient belonging to another health sector in the Community of Madrid or other community
participation in another study within 6 months prior.

Annotated entities:
- Observation: "osteoarticular limitation"
- Observation: "neuromuscular limitation"
- Observation: "cognitive limitation"
- Negation: "prevents"
- Observation: "ambulation"
- Condition: "neoplastic disease"
- Person: "institutionalized"
- Observation: "alcohol consumption"
- Multiplier: ">60 g/day"
- Non-query-able: "patient belonging to another health sector in the Community of Madrid or other community"
- Competing_trial: "participation in another study within 6 months prior."